Clinical trial inclusion criterion:
7. Maternal and fetal condition remain stable after hospitalization for 72 hours

Entity relations:
- Has_index("after hospitalization for 72 hours", "hospitalization")
- Has_qualifier("fetal condition", "stable")
- Has_temporal("fetal condition", "after hospitalization for 72 hours")
- Has_qualifier("Maternal condition", "stable")
- Has_temporal("Maternal condition", "after hospitalization for 72 hours")